Clinical trial exclusion criterion:
Smoking (current smokers and patients who quit smoking less than six months)

Entity relations:
- Has_temporal("smokers", "current")